Clinical trial inclusion criterion:
systolic blood pressure between 140-160 mmHG

Annotated entities:
- Measurement: "systolic blood pressure"
- Value: "between 140-160 mmHG"